Provision of informed consent prior to any study specific procedures;

The above is a clinical trial inclusion criterion. Annotated with entity spans:
[Non-query-able: Provision of informed consent prior to any study specific procedures;]